Clinical trial inclusion criterion:
Ritonavir (RTV) to cobicistat (COBI)/COBI-containing fixed-dose combination regimens

Annotated entities:
- Drug: "Ritonavir (RTV)"
- Drug: "cobicistat (COBI)"
- Procedure: "COBI-containing fixed-dose combination regimens"